Unmyelinated C fibers主要與下列何種感覺有關？
A. pressure
B. smell
C. touch
D. temperature

正確答案：D. temperature